Clinical trial exclusion criterion:
painful regular uterine contractions

Annotated entities:
- Condition: "painful regular uterine contractions"